unstable condition on anti-parkinsonian medications;

The above is a clinical trial exclusion criterion. Annotated with entity spans:
[Undefined_semantics: unstable condition on anti-parkinsonian medications];